The use of weight-lowering drugs, any investigational blood-glucose or lipid-lowering agent (other than statins or ezetimibe) within the past 3 months

The above is a clinical trial exclusion criterion. Annotated with entity spans:
The use of [Qualifier: weight-lowering] [Drug: drugs], any [Qualifier: investigational] [Qualifier: blood-glucose] or [Qualifier: lipid-lowering] [Drug: agent] ([Negation: other] than [Drug: statins] or [Drug: ezetimibe]) within the [Temporal: past 3 months]